Clinical trial exclusion criterion:
Renal failure / patients undergoing dialysis

Entity relations:
- OR("Renal failure", "dialysis")